目前由於免疫抑制劑的進步，移植的腎臟在接受者體內一年存活率達 90%以上，五年亦達 70%左右，但是長期存活率並未有顯著突破。有關移植的腎臟長期的變化，下列那一項敘述錯誤？
A. 移植的腎臟顯示小動脈硬化，腎絲球及腎小管纖維化及萎縮
B. 巨噬細胞侵入移植腎臟的血管及組織，引起慢性炎症反應
C. 長期使用環孢靈素（cyclosporin A），導致腎臟組織的環孢靈素毒性變化
D. 由於接受者體內在移植前已經存在的抗體，攻擊移植腎臟的內皮細胞，引起小血管阻塞

正確答案：D. 由於接受者體內在移植前已經存在的抗體，攻擊移植腎臟的內皮細胞，引起小血管阻塞